下列有關隅角（anterior chamber angle）的敘述，何者錯誤？
A. 隅角鏡（gonioscopy）可用來觀察隅角
B. 小樑網（trabecular meshwork），鞏膜棘（scleral spur），虹膜突（iris process）都可看到時隅角是開放的（open）
C. 近視眼的眼球隅角通常較窄
D. 有些隅角閉鎖性青光眼是因老年性白內障時水晶體變厚導致

正確答案：C. 近視眼的眼球隅角通常較窄